一位 70 歲男性淋巴癌病人，分期為 Ann Arbor 第四期，血清 LDH 值 6,500 U/L（正常＜200 U/L），患者在接受化學治療兩天後發生呼吸急促、寡尿、抽筋等症狀，此時抽血檢查，下列結果何者最不可能出現？
A. 血鉀過高
B. 血中 pH 值偏酸
C. 血磷過低
D. 血鈣偏低

正確答案：C. 血磷過低